關於胰島素瘤（insulinoma）之敘述，下列何者錯誤？
A. 是最常見的胰臟內分泌腫瘤
B. 大多為惡性的胰臟內分泌腫瘤
C. 診斷insulinoma重要的臨床症狀是Whipple's triad，包括低血糖的症狀、當時測得的血糖濃度偏低，及給予靜脈注射葡萄糖液可以減輕低血糖的症狀
D. 定位insulinoma的影像學工具包括有腹部電腦斷層及磁振造影

正確答案：B. 大多為惡性的胰臟內分泌腫瘤